¿En qué consiste la fase de “Instalación” de la técnica de desensibilización y reprocesamiento por movimientos oculares (DRMO o EMDR) de Shapiro para el tratamiento del estrés postraumático? :
1. Instaurar una sólida relación terapéutica.
2. Elegir la imagen objetivo que representa el pero aspecto de trauma.
3. Desensibilizar la imagen.
4. Activar la estimulación bilateral cerebral.
5. Emparejar una cognición positiva con la imagen original a través del movimiento ocular o sus alternativas.

Respuesta correcta: 5. Emparejar una cognición positiva con la imagen original a través del movimiento ocular o sus alternativas.